一位 49 歲女性病患因上腹以及左上腹區域疼痛約二至三天而求診，急診室的檢查結果顯示 Hb 10.4 g/dL， WBC 分類 N/L 79.9%/14.5%，glucose 115 mg/dL，BUN 13 mg/dL，creatinine 0.9 mg/dL，CRP 10.8 mg/L， lipase 173 U/L，amylase 67 U/L，triglyceride 1634 mg/dL。最可能的診斷為何？
A. 子宮外孕（ectopic pregnancy）
B. 卵巢癌（ovarian cancer）
C. 急性胰臟炎（acute pancreatitis）
D. 急性闌尾炎（acute appendicitis）

正確答案：C. 急性胰臟炎（acute pancreatitis）